依據國際衛生組織（WHO）的分類，如欲診斷急性白血病，骨髓中芽球（blast form）至少需占有核細胞的百分比為何？
A. 50%
B. 40%
C. 30%
D. 20%

正確答案：D. 20%